下列敘述，何者錯誤？
A. 大多數的肺栓塞（pulmonary embolism）是起源於深層靜脈栓塞（deep venous thrombosis）
B. 老年人常因營養不良而有比較高的手術後併發症發生率
C. 肥胖與營養不良並不會增加傷口裂開的機率
D. 手術後的疼痛、輸液量過多會導致高血壓

正確答案：C. 肥胖與營養不良並不會增加傷口裂開的機率